La afasia de conducción se caracteriza por:
1. Habla fluida y con significado, compresión relativamente buena y repetición alterada.
2. Habla no fluida, comprensión relativamente buena y repetición alterada.
3. Habla fluida con poco significado, compresión alterada y repetición alterada.
4. Habla no fluida, comprensión alterada y repetición alterada.
5. Habla fluida con poco significado, comprensión buena y repetición no alterada.

Respuesta correcta: 1. Habla fluida y con significado, compresión relativamente buena y repetición alterada.